Clinical trial exclusion criterion:
Prior use of or a known allergy or hypersensitivity to pregabalin.

Entity relations:
- AND("allergy", "pregabalin")
- OR("allergy", "hypersensitivity")